全身麻醉病人接受輸血時，若發生血型配對不合引起急性溶血，病人不會呈現下列何種現象？
A. 低血壓
B. 溶血尿
C. 全身廣泛滲血
D. 尿崩症

正確答案：D. 尿崩症